Clinical trial inclusion criterion:
tolerance of parenteral or enteral nutrition

Entity relations:
- AND("tolerance", "parenteral nutrition")
- OR("parenteral nutrition", "enteral nutrition")